Clinical trial inclusion criterion:
Patients presenting for CMR with the clinical diagnosis of hypertrophic cardiomyopathy based on left ventricular wall thickness of at least =15 mm in the absence of any other cardiac or systemic cause of hypertrophy

Entity relations:
- Has_negation("cardiac cause of hypertrophy", "absence")
- Has_value("left ventricular wall thickness", "at least =15 mm")
- AND("hypertrophic cardiomyopathy", "cardiac cause of hypertrophy")
- AND("hypertrophic cardiomyopathy", "left ventricular wall thickness")
- OR("cardiac cause of hypertrophy", "systemic cause of hypertrophy")